Clinical trial exclusion criteria:
Presence of systemic diseases;
Presence of local inflammation and/or infection;
Any history of allergic reaction to local anesthetics, gastrointestinal bleeding or ulceration;
Cardiovascular, kidney or hepatic diseases;
Patients who are making use of antidepressants, diuretics or anticoagulants;
Asthma and allergy to aspirin, ibuprofen or any other nonsteroidal antiinflammatory drug;
Regular use of any nonsteroidal antiinflammatory drug,
Pregnancy or breast feeding.

Annotated entities:
- Condition: "systemic diseases"
- Condition: "local inflammation"
- Condition: "local infection"
- Temporal: "history"
- Condition: "allergic reaction"
- Drug: "local anesthetics"
- Condition: "gastrointestinal bleeding"
- Condition: "gastrointestinal ulceration"
- Condition: "Cardiovascular diseases"
- Condition: "kidney diseases"
- Condition: "hepatic diseases"
- Drug: "antidepressants"
- Drug: "diuretics"
- Drug: "anticoagulants"
- Condition: "Asthma"
- Condition: "allergy"
- Drug: "aspirin"
- Drug: "ibuprofen"
- Drug: "nonsteroidal antiinflammatory drug"
- Qualifier: "any other"
- Multiplier: "Regular use"
- Condition: "nonsteroidal antiinflammatory drug"
- Condition: "Pregnancy"
- Observation: "breast feeding"